Birthweight >2500g

The above is a clinical trial inclusion criterion. Annotated with entity spans:
[Measurement: Birthweight] [Value: >2500g]